Portal vein thrombosis

The above is a clinical trial exclusion criterion. Annotated with entity spans:
[Condition: Portal vein thrombosis]